Subjects with cognitive, psychiatric, or other problems that preclude informed consent.

The above is a clinical trial exclusion criterion. Annotated with entity spans:
[Undefined_semantics: Subjects with cognitive, psychiatric, or other problems that preclude informed consent].